最常見的性聯遺傳型嚴重混合性免疫缺損（XSCID）病患細胞中，產生基因突變的白血球分子應該歸為於下列那一種類？
A. 細胞激素接受體的訊息傳遞分子
B. 細胞骨架的組成分子
C. 細胞游走（migration）所需要的粘	分子
D. 血球產生活性氧自由基的酵素

正確答案：A. 細胞激素接受體的訊息傳遞分子